List functions that are evaluated with the Full Outline of Unresponsiveness score?

The FOUR (Full Outline of UnResponsiveness) score, a new coma scale, evaluates 4 components: eye and motor responses, brainstem reflexes and respiration.